Clinical trial inclusion criterion:
Has documented objective radiographic progression during or after treatment with sorafenib or oxaliplatin-based chemotherapy, or else intolerance to sorafenib or oxaliplatin-based chemotherapy

Annotated entities:
- Procedure: "radiographic"
- Observation: "objective progression"
- Temporal: "during or after"
- Reference_point: "treatment with sorafenib or oxaliplatin-based chemotherapy"
- Drug: "sorafenib"
- Drug: "oxaliplatin"
- Qualifier: "sorafenib or oxaliplatin-based"
- Procedure: "chemotherapy"
- Condition: "intolerance"
- Drug: "sorafenib"
- Drug: "oxaliplatin"
- Qualifier: "sorafenib or oxaliplatin-based"
- Procedure: "chemotherapy"